Clinical trial inclusion criterion:
Macula edema secondary to BRVO

Entity relations:
- AND("Macula edema", "BRVO")